Clinical trial inclusion criterion:
Have sickle cell disease (confirmed by Hb electrophoresis or more specific tests) or other conditions with iron overload from repeated blood transfusions (see exclusion criteria for exceptions);

Annotated entities:
- Condition: "sickle cell disease"
- Procedure: "Hb electrophoresis"
- Procedure: "more specific tests"
- Condition: "other conditions with iron overload"
- Multiplier: "repeated"
- Procedure: "blood transfusions"